Clinical trial inclusion criteria:
Patients with foot fracture scheduled for surgical repair in spinal anesthesia
Informed consent

Annotated entities:
- Condition: "foot fracture"
- Mood: "scheduled for"
- Procedure: "surgical repair"
- Procedure: "spinal anesthesia"
- Informed_consent: "Informed consent"